Clinical trial inclusion criteria:
Women with expected difficult IUD insertion like nulliparous women and women with previous cesarean section.

Annotated entities:
- Person: "Women"
- Mood: "expected"
- Qualifier: "difficult"
- Procedure: "IUD insertion"
- Observation: "nulliparous"
- Person: "women"
- Person: "women"
- Temporal: "previous"
- Procedure: "cesarean section"